Clinical trial inclusion criterion:
11. Serum potassium, magnesium, and calcium levels should be at least within institutional normal limits.

Entity relations:
- Has_value("Serum potassium", "at least within institutional normal limits")
- Has_value("Serum magnesium", "at least within institutional normal limits")
- Has_value("Serum calcium", "at least within institutional normal limits")